7. Have a ventilation-perfusion scan that rules out thromboembolic disease.

The above is a clinical trial inclusion criterion. Annotated with entity spans:
[Parsing_Error: 7.] Have a [Procedure: ventilation-perfusion scan] that [Negation: rules out] [Condition: thromboembolic disease].